Clinical trial exclusion criterion:
Other diseases/abnormalities: Any life-threatening condition with life expectancy <3 years, other than vascular disease or COPD, that might prevent the subject from completing the study.

Annotated entities:
- Observation: "life expectancy"
- Value: "<3 years"
- Condition: "life-threatening condition"
- Condition: "vascular disease"
- Condition: "COPD"
- Subjective_judgement: "that might prevent the subject from completing the study"
- Negation: "other than"